Respecto de la prevalencia de los trastornos depresivos en función del sexo, cabe afirmar que:
1. La prevalencia es similar en hombres y mujeres.
2. La prevalencia es aproximadamente el doble en hombres que en mujeres.
3. La prevalencia es aproximadamente el doble en mujeres que en hombres.
4. La prevalencia es aproximadamente el triple en mujeres que en hombres.

Respuesta correcta: 3. La prevalencia es aproximadamente el doble en mujeres que en hombres.